What is the most common monogenic cause of common variable immunodeficiency (CVID) in Europeans?

Heterozygous loss-of-function variants in NFKB1 are the most common known monogenic cause of common variable immunodeficiency (CVID), which results in a temporally progressive defect in the formation of immunoglobulin-producing B cells.